Clinical trial inclusion criterion:
18 years old or older

Annotated entities:
- Value: "18 years or older"
- Person: "old"